有關小腸腫瘤之敘述，下列何者錯誤？
A. 腺癌發生的部位以十二指腸和上端空腸較多，遠端空腸或迴腸就較少
B. 若小腸癌發生在十二指腸以外，術前的正確診斷率只有50%左右
C. 手術完全切除才較有機會治癒，化學治療和放射治療效果至目前結果都不好
D. 若剖腹進去發現已有腸繫膜轉移，因預後很差，就算病患有出血或腸阻塞，也完全不用做palliative surgery

正確答案：D. 若剖腹進去發現已有腸繫膜轉移，因預後很差，就算病患有出血或腸阻塞，也完全不用做palliative surgery